Systolic heart failure with New York Heart Association (NYHA) class II-III.

The above is a clinical trial inclusion criterion. Annotated with entity spans:
[Condition: Systolic heart failure] with [Measurement: New York Heart Association (NYHA)] [Value: class II-III].